Clinical trial exclusion criterion:
GI intolerance of tuberculosis medications requiring discontinuation of tuberculosis medications.

Annotated entities:
- Condition: "GI intolerance"
- Drug: "tuberculosis medications"
- Drug: "tuberculosis medications"
- Procedure: "discontinuation"